Not specified

The above is a clinical trial inclusion criterion. Annotated with entity spans:
[Non-representable: Not specified]